¿De qué autores es el modelo de prevención de recaídas más conocido y con buen apoyo empírico en el alcoholismo?:
1. Marlatt y Gordon.
2. Miller y Rollnick.
3. Beck y Ellis.
4. Sobell y Sobell.
5. Hunt y Arzin.

Respuesta correcta: 1. Marlatt y Gordon.